Clinical trial inclusion criterion:
ECOG Score of 0 or 1.

Entity relations:
- Has_value("ECOG Score", "0 or 1")